Cuando se dice que el código genético es “degenerado”, significa que::
1. Hay varios codones de parada y de inicio.
2. El código genético de los eucariotas es diferente del de las bacterias.
3. Un codón codifica varios aminoácidos.
4. La mayor parte de los aminoácidos están codificados por más de un codón.
5. Ninguna de las opciones anteriores.

Respuesta correcta: 4. La mayor parte de los aminoácidos están codificados por más de un codón.